Clinical trial exclusion criteria:
Past history of hypersensitivity to aripiprazole
Primary diagnosis of MDD with psychotic feature, bipolar disorder, schizophrenia, schizoaffective disorder, other psychotic disorder or anxiety disorder, a history of alcohol/ drug abuse within the past 12 months, or a diagnosis of dementia
Clinically significant current Axis II (DSM-IV-TR) diagnosis
A significant risk of suicide corroborated by a score of =5 on item 10(suicidal thoughts) on the MADRS scale or by clinical judgment of the investigator
Pregnancy or in breast-feeding
Presence of a serious medical illness including cardiac, hepatic, renal, respiratory, endocrinologic, neurologic, or hematologic disease or physical disorder judged to significantly affect central nervous system function
Patients taking antipsychotics, mood stabilizer or any psychotropic medications besides antidepressants, except benzodiazepines or beta blockers or hypnotics
Patients with past treatment failures of aripiprazole

Annotated entities:
- Condition: "hypersensitivity"
- Drug: "aripiprazole"
- Condition: "MDD"
- Condition: "psychotic feature"
- Condition: "bipolar disorder"
- Condition: "schizophrenia"
- Condition: "schizoaffective disorder"
- Condition: "psychotic disorder"
- Qualifier: "other"
- Condition: "anxiety disorder,"
- Condition: "drug abuse"
- Condition: "alcohol abuse"
- Temporal: "within the past 12 months"
- Condition: "dementia"
- Qualifier: "Axis II"
- Condition: "diagnosis"
- Qualifier: "DSM-IV-TR"
- Observation: "risk of suicide"
- Qualifier: "significant"
- Measurement: "MADRS scale"
- Value: "score of =5 on item 10"
- Non-query-able: "by clinical judgment of the investigator"
- Pregnancy_considerations: "Pregnancy or in breast-feeding"
- Qualifier: "serious"
- Condition: "medical illness"
- Condition: "cardiac"
- Condition: "hepatic"
- Condition: "renal"
- Condition: "respiratory"
- Condition: "endocrinologic"
- Condition: "neurologic"
- Condition: "hematologic disease"
- Condition: "physical disorder"
- Non-query-able: "Presence of a serious medical illness including cardiac, hepatic, renal, respiratory, endocrinologic, neurologic, or hematologic disease or physical disorder judged to significantly affect central nervous system function"
- Drug: "antipsychotics"
- Drug: "mood stabilizer"
- Drug: "psychotropic medications"
- Negation: "besides"
- Drug: "antidepressants"
- Negation: "except"
- Drug: "benzodiazepines"
- Drug: "beta blockers"
- Drug: "hypnotics"
- Drug: "aripiprazole"
- Observation: "treatment failures"